Clinical trial exclusion criterion:
Pregnancy or other Nicotine Replacement Therapy (NRT) contraindications

Annotated entities:
- Condition: "Pregnancy"
- Condition: "contraindications"
- Procedure: "Nicotine Replacement Therapy"
- Procedure: "NRT"